Clinical trial exclusion criterion:
Documented LA thrombus on imaging

Annotated entities:
- Condition: "LA thrombus"
- Procedure: "imaging"